Clinical trial exclusion criterion:
Current or chronic history of liver disease, or known hepatic or biliary abnormalities (with the exception of Gilbert's syndrome or asymptomatic gallstones).

Entity relations:
- Has_temporal("liver disease", "history")
- Has_temporal("liver disease", "Current")
- Has_qualifier("gallstones", "asymptomatic")
- Has_negation("Gilbert's syndrome", "exception")
- Has_negation("gallstones", "exception")
- AND("liver disease", "Gilbert's syndrome")
- OR("Current", "chronic")
- OR("liver disease", "biliary abnormalities", "hepatic abnormalities")
- OR("Gilbert's syndrome", "gallstones")